Clinical trial exclusion criterion:
Moderate or severe liver affection associated with coagulopathy

Annotated entities:
- Qualifier: "Moderate"
- Qualifier: "severe"
- Condition: "liver affection"
- Qualifier: "associated with coagulopathy"
- Condition: "coagulopathy"